Clinical trial exclusion criterion:
Pregnant or lactational women.

Annotated entities:
- Condition: "Pregnant"
- Condition: "lactational"
- Person: "women"